Los animales NO pueden sintetizar glucosa a partir de:
1. Glicerol.
2. Alanina.
3. Palmitato.
4. Oxalacetato.
5. Lactato.

Respuesta correcta: 3. Palmitato.